Subject has any mental or neuromuscular disorder which would create an unacceptable risk of fixation failure or complications in postoperative care.

The above is a clinical trial inclusion criterion. Annotated with entity spans:
Subject has any [Condition: mental] or [Condition: neuromuscular disorder] which would create an [Qualifier: unacceptable] [Mood: risk of] [Condition: fixation failure] or [Condition: complications] in postoperative care.